Males or non-pregnant, non-nursing females

The above is a clinical trial inclusion criterion. Annotated with entity spans:
[Person: Males] or [Negation: non-][Condition: pregnant], [Negation: non-][Observation: nursing] [Person: females]